Clinical trial exclusion criterion:
Inflammation or infection at the study site

Annotated entities:
- Condition: "Inflammation"
- Condition: "infection"
- Qualifier: "study site"